Clinical trial exclusion criterion:
Pregnant women or nursing mothers who are not willing to stop breastfeeding.

Annotated entities:
- Pregnancy_considerations: "Pregnant women or nursing mothers who are not willing to stop breastfeeding"